El alcohol se incluye en el grupo de drogas sedantes o depresoras debido a que actúa como:
1. Agonista de los receptores colinérgicos: nicotínicos y muscarínicos.
2. Antagonista de los receptores serotoninérgicos (5- HT) y colinérgicos.
3. Agonista de los receptores noradrenérgicos y antagonista serotoninérgico.
4. Antagonista de los receptores NMDA y agonista de los receptores AMPA.
5. Agonista de los receptores GABA-a y antagonista de los receptores NMDA.

Respuesta correcta: 5. Agonista de los receptores GABA-a y antagonista de los receptores NMDA.